Clinical trial exclusion criterion:
Patients with liver cirrhosis, Hepatocellular Carcinoma or AFP >2 ULN or other malignancies.

Entity relations:
- Has_value("AFP", ">2 ULN")
- OR("liver cirrhosis", "Hepatocellular Carcinoma", "AFP", "malignancies")